Clinical trial exclusion criterion:
History of or presence of any clinically significant disease or disorder including a recent (< 3 months) cardiovascular event which, in the opinion of the Investigator, may either put the patient at risk because of participation in the study or influence the results or the patient's ability to participate in the study.

Entity relations:
- Subsumes("recent", "< 3 months")